有關氣喘之病理特徵敘述，何者錯誤？
A. 支氣管痙攣
B. 黏液阻塞
C. α1抗胰蛋白酵素（α1-antitrypsin）缺乏
D. 痰中出現夏萊二氏晶體（Charcot-Leyden crystal）

正確答案：C. α1抗胰蛋白酵素（α1-antitrypsin）缺乏